Fetus with IUGR

The above is a clinical trial exclusion criterion. Annotated with entity spans:
[Condition: Fetus] with [Condition: IUGR]